What percentage of currently available drugs are metabolized by CYP3A4?

CYP3A4 metabolizes approximately 50% of the drugs available today on the market.